Señale la respuesta INCORRECTA con respecto a la genómica nutricional:
1. En algunos individuos y bajo ciertas circunstancias la dieta puede ser un factor de riesgo importante para el desarrollo de diversas enfermedades.
2. Las sustancias químicas existentes en la dieta pueden modificar de manera directa e indirecta la salud del propio genoma y su expresión génica.
3. La influencia de la dieta en la salud no depende de la constitución genética del individuo.
4. La dieta regula algunos genes o sus variantes, lo que puede jugar un papel importante en las enfermedades crónicas.

Respuesta correcta: 3. La influencia de la dieta en la salud no depende de la constitución genética del individuo.